Clinical trial inclusion criterion:
evaluated for an STI within 6 months prior to screening

Entity relations:
- Has_index("within 6 months prior to screening", "screening")
- Has_temporal("evaluated for an STI", "within 6 months prior to screening")